El Life Orientation Test (LOT desarrollado por Scheier y Carver en 1985) es un test que mide:
1. Expectativas generales relacionadas con el optimismo.
2. Bienestar psicológico a lo largo del ciclo vital.
3. Estilos de afrontamiento emocionales.
4. Orientación y preferencias sexuales.
5. Emociones positivas y felicidad.

Respuesta correcta: 1. Expectativas generales relacionadas con el optimismo.